缺血性大腸炎（ischemic colitis）最常發生於下列那些部位？
A. 盲腸與脾彎曲
B. 肝彎曲與乙狀結腸
C. 脾彎曲與乙狀結腸
D. 盲腸與乙狀結腸

正確答案：C. 脾彎曲與乙狀結腸